Actualmente, ¿cuál de los siguientes tratamientos conductuales es considerado un tratamiento eficaz para el trastorno depresivo mayor?
1. La relajación aplicada.
2. La terapia de solución de problemas.
3. La inundación.
4. La terapia interpersonal.
5. La detención del pensamiento.

Respuesta correcta: 2. La terapia de solución de problemas.